En el modelo de Plá y Moreno para explicar la absorción gastrointestinal de fármacos, la relación entre la constante de absorción (ka) y el coeficiente de reparto es:
1. Hiperbólica.
2. Bihiperbólica.
3. Parabólica.
4. Lineal.

Respuesta correcta: 2. Bihiperbólica.